Clinical trial exclusion criteria:
Chronic pain more than 3 months
Drug abuse
Chronic use of analgesic drugs (more than 3 months)
Psychiatric illness
Peripheral neuropathy
Drug allergy
Severe gastroesophageal reflux disease

Annotated entities:
- Condition: "Chronic pain"
- Temporal: "more than 3 months"
- Condition: "Drug abuse"
- Temporal: "Chronic"
- Drug: "analgesic drugs"
- Temporal: "more than 3 months"
- Condition: "Psychiatric illness"
- Condition: "Peripheral neuropathy"
- Condition: "allergy"
- Drug: "Drug"
- Condition: "gastroesophageal reflux disease"
- Qualifier: "Severe"